Indicar cuál de los siguientes compuestos es una proteína fibrosa:
1. Quimotripsina.
2. Citocromo c.
3. Alfa-queratina.
4. Lisozima.
5. Ribonucleasa.

Respuesta correcta: 3. Alfa-queratina.